cancer as the reason for intestinal failure

The above is a clinical trial exclusion criterion. Annotated with entity spans:
[Condition: cancer] as the reason for [Condition: intestinal failure]